Clinical trial exclusion criterion:
Pregnant or lactating women

Annotated entities:
- Condition: "Pregnant"
- Condition: "lactating"
- Person: "wome"